Clinical trial exclusion criterion:
Pregnant/lactating

Entity relations:
- OR("Pregnant", "lactating")